Clinical trial exclusion criterion:
The score of the sixth item of HAMA =3

Entity relations:
- Has_value("score of the sixth item of HAMA", "=3")